Clinical trial inclusion criterion:
patients with a diagnosis of either cervical, thoracic, or lumbar facet or sacroiliac joint pain who have responded to medial branch blocks and are already scheduled for bilateral radiofrequency ablations

Annotated entities:
- Condition: "cervical joint pain"
- Condition: "thoracic joint pain"
- Condition: "lumbar facet joint pain"
- Condition: "sacroiliac joint pain"
- Procedure: "medial branch blocks"
- Observation: "responded"
- Mood: "scheduled for"
- Procedure: "bilateral radiofrequency ablations"